Clinical trial exclusion criterion:
3. Clinically significant persistent immune-related adverse events following prior therapy.

Annotated entities:
- Parsing_Error: "3."
- Condition: "immune-related adverse events"
- Temporal: "following prior therapy"
- Reference_point: "prior therapy"
- Qualifier: "Clinically significant"
- Qualifier: "persistent"
- Subjective_judgement: "Clinically significant"
- Undefined_semantics: "Clinically significant"